Good general health

The above is a clinical trial inclusion criterion. Annotated with entity spans:
[Condition: Good general health]